Preoperative neurological deficits

The above is a clinical trial exclusion criterion. Annotated with entity spans:
[Qualifier: Preoperative] [Condition: neurological deficits]